Where is the enzyme PM20D1 localized?

PM20D1 is enriched in UCP1+ adipocytes